Clinical trial exclusion criterion:
Concomitant use of CYP3A4 or p-glycoprotein inducers or inhibitors

Entity relations:
- Has_temporal("CYP3A4", "Concomitant")
- Has_temporal("p-glycoprotein inhibitors", "Concomitant")
- Has_temporal("p-glycoprotein inducers", "Concomitant")
- OR("CYP3A4", "p-glycoprotein inducers", "p-glycoprotein inhibitors")